Clinical trial inclusion criterion:
Blasts = 1,000/µL in PB on day 8

Entity relations:
- Has_value("Blasts", "= 1,000/µL")
- Has_qualifier("Blasts", "PB")
- Has_temporal("Blasts", "on day 8")